Clinical trial inclusion criterion:
Patients must be at least 18 years of age.

Annotated entities:
- Value: "at least 18 years"
- Person: "age"